探討貧窮與兒童肥胖之間的關係，若非貧窮兒童的肥胖率為 20%，貧窮兒童的肥胖率為 40%，下列敘述何者正確？
A. 貧窮是肥胖的危險因子，相對危險比（relative risk）為 2
B. 貧窮是肥胖的危險因子，相對危險比（relative risk）為 1/2
C. 貧窮是肥胖的保護因子，相對危險比（relative risk）為 2
D. 貧窮是肥胖的保護因子，相對危險比（relative risk）為 1/2

正確答案：A. 貧窮是肥胖的危險因子，相對危險比（relative risk）為 2